Clinical trial exclusion criterion:
allergy to any of the drugs used in this study

Annotated entities:
- Non-representable: "allergy to any of the drugs used in this study"